Clinical trial exclusion criterion:
Patients known to be colonized with Methicillin-resistant S. aureus (MRSA)(unethical not to administer glycopeptides), beta-lactam or vancomycin allergy precluding the use of cefazolin or vancomycin, respectively, or to silver precluding the use of Prevena

Entity relations:
- Has_qualifier("colonized", "Methicillin-resistant S. aureus (MRSA)")
- AND("allergy", "beta-lactam")
- OR("beta-lactam", "vancomycin", "silver", "vancomycin", "cefazolin")